Clinical trial inclusion criterion:
diagnosed any form of MS (relapsing remitting, primary progressive, secondary progressive), any EDSS (expanded stability status scale) score

Entity relations:
- Has_qualifier("MS", "any form")
- Subsumes("any form", "relapsing remitting")
- Subsumes("score EDSS", "expanded stability status scale")
- Has_value("score EDSS", "any")
- OR("relapsing remitting", "primary progressive", "secondary progressive")